Clinical trial inclusion criterion:
Male or female patients 2 to 16 years of age

Entity relations:
- Has_value("age", "2 to 16 years")
- OR("Male", "female")